膀胱上動脈（superior vesical artery）源自何處？
A. 臍動脈（umbilical artery）
B. 閉孔動脈（obturator artery）
C. 臀上動脈（superior gluteal artery）
D. 直腸上動脈（superior rectal artery）

正確答案：A. 臍動脈（umbilical artery）